Currently enrolled in, or discontinued within the last 30 days from, a clinical trial involving an off-label use of an investigational drug.

The above is a clinical trial exclusion criterion. Annotated with entity spans:
[Competing_trial: Currently enrolled in, or discontinued within the last 30 days from, a clinical trial involving an off-label use of an investigational drug.]